Clinical trial exclusion criterion:
Uncontrolled Diabetes [hemoglobin A1c, (HbA1c) >7.5%].

Entity relations:
- Has_qualifier("Diabetes", "Uncontrolled")
- Subsumes("hemoglobin A1c", "HbA1c")
- Has_value("hemoglobin A1c", ">7.5%")
- AND("Diabetes", "hemoglobin A1c")